Clinical trial exclusion criterion:
Pregnancy or lactation.

Annotated entities:
- Condition: "Pregnancy"
- Condition: "lactation"